Clinical trial exclusion criteria:
Planned surgery under regional anesthesia
contraindication to the study drug
contraindication to the lumbar puncture
Contraindication to oxycodone
Pregnancy or lactation
no informed consent

Annotated entities:
- Procedure: "surgery"
- Procedure: "regional anesthesia"
- Mood: "Planned"
- Condition: "contraindication"
- Drug: "study drug"
- Condition: "contraindication"
- Procedure: "lumbar puncture"
- Condition: "Contraindication"
- Drug: "oxycodone"
- Condition: "Pregnancy"
- Condition: "lactation"
- Non-query-able: "no informed consent"